Clinical trial exclusion criterion:
3. Uncontrolled inter-current illness

Annotated entities:
- Parsing_Error: "3."
- Condition: "inter-current illness"
- Qualifier: "Uncontrolled"
- Undefined_semantics: "Uncontrolled inter-current illness"
- Temporal: "inter-current"